以下何者不適合脫離呼吸器？
A. 潮氣量（tidal volume）大於 5 mL/kg
B. 呼吸速率小於 30 次/min
C. 每分鐘通氣量（minute ventilation）大於 15 L/min
D. Rapid shallow breathing index 小於 80

正確答案：C. 每分鐘通氣量（minute ventilation）大於 15 L/min